下列關於青少年肌陣攣癲癇（juvenile myoclonic epilepsy）的敘述，何者錯誤？
A. 發作都是全面癲癇發作（generalized seizures）
B. 以晨間睡醒時肌陣攣發作（myoclonic seizures）為主
C. 大部分無法痊癒
D. 目前尚未發現家族癲癇病史的相關性

正確答案：D. 目前尚未發現家族癲癇病史的相關性